Clinical trial exclusion criterion:
osteoarticular, neuromuscular or cognitive limitation that prevents ambulation

Annotated entities:
- Observation: "osteoarticular limitation"
- Observation: "neuromuscular limitation"
- Observation: "cognitive limitation"
- Negation: "prevents"
- Observation: "ambulation"